Clinical trial inclusion criterion:
Age 1 day to less than 18 years

Annotated entities:
- Person: "Age"
- Value: "1 day to less than 18 years"